Subjects must have normal organ and marrow function as defined below:

The above is a clinical trial inclusion criterion. Annotated with entity spans:
Subjects must have [Condition: normal organ] and marrow function as defined below: